一位 42 歲母親，20 年前罹患子宮內膜異位症曾接受手術治療，現在她的大女兒也有相同疾病，她很擔心二女兒也會有相同疾病。據你所知，子宮內膜異位症可能是下列那一種疾病？
A. Autosomal recessive with variable penetrance
B. Polygenic multifactorial
C. Spontaneous mutations
D. No evidence of genetic inheritance

正確答案：B. Polygenic multifactorial